Clinical trial exclusion criterion:
don't have Diabetes and abnormal metabolism of sugar

Annotated entities:
- Negation: "don't have"
- Condition: "Diabetes"
- Condition: "abnormal metabolism of sugar"